Which are the enzymes involved in the addition of 7-methylguanosine in mRNA?

The enzymes involved in the addition of 7-methylguanosine in mRNA are RNA guanylyltransferase and 5'-phosphatase (RNGTT), RNA guanine-7 methyltransferase (RNMT or hMTr1), RNMT-activating mini-protein (RAM), RNA polymerase II, S-adenosylhomocysteine hydrolase (SAHH), and Myc.